A history of immunodeficiency.

The above is a clinical trial exclusion criterion. Annotated with entity spans:
A [Condition: history of immunodeficiency].